下列有關神經心理測驗（neuropsychological assessment）的敘述，何者錯誤？
A. 昏迷指數（coma scale）可用於篩檢急性神經損傷的病人
B. 腦傷認知功能評估（Rancho scale）無法用來觀察神經損傷病人功能的進步情形
C. 神經心理測驗可幫助復健計畫的擬定
D. 有情緒及行為問題的病人，其復健訓練亦會受到影響

正確答案：B. 腦傷認知功能評估（Rancho scale）無法用來觀察神經損傷病人功能的進步情形